Clinical trial exclusion criteria:
major systemic disease
Pregnant woman with infection of human immunodeficiency virus or hepatitis C virus
Pregnant woman is receiving any drug with antiviral activity or any form of drug therapy for hepatitis B virus
Pregnant woman whose ultrasonographic examination reveals congenital anomaly of the fetus
Pregnant woman whose amniocentesis reveals any genetic abnormality

Annotated entities:
- Condition: "major systemic disease"
- Condition: "Pregnant"
- Person: "woman"
- Condition: "human immunodeficiency virus"
- Condition: "hepatitis C virus"
- Condition: "Pregnant"
- Person: "woman"
- Drug: "drug with antiviral activity"
- Procedure: "drug therapy"
- Condition: "hepatitis B virus"
- Condition: "Pregnant"
- Person: "woman"
- Procedure: "ultrasonographic examination"
- Value: "congenital anomaly of the fetus"
- Condition: "Pregnant"
- Person: "woman"
- Procedure: "amniocentesis"
- Value: "genetic abnormality"